Clinical trial exclusion criterion:
Anemia defined as Hemoglobin (Hb) < 115 g/L (7.1 mM) in women and < 120 g/L (7.5 mM) in men.

Annotated entities:
- Condition: "Anemia"
- Measurement: "Hemoglobin (Hb)"
- Value: "< 115 g/L"
- Value: "7.1 mM"
- Person: "women"
- Value: "< 120 g/L"
- Value: "7.5 mM"
- Person: "men"